Clinical trial exclusion criterion:
Valvular cardiac surgical/percutaneous procedure (i.e., ventriculotomy, atriotomy, and valve repair or replacement and presence of a prosthetic valve)

Entity relations:
- Subsumes("Valvular cardiac surgical procedure", "ventriculotomy")
- OR("Valvular cardiac surgical procedure", "Valvular cardiac percutaneous procedure")
- OR("ventriculotomy", "atriotomy", "valve replacement", "valve repair", "prosthetic valve")